Clinical trial exclusion criterion:
apnea hypopnea index > 5 events per hour

Annotated entities:
- Measurement: "apnea hypopnea index"
- Value: "> 5 events per hour"